full term singleton pregnant women

The above is a clinical trial inclusion criterion. Annotated with entity spans:
[Qualifier: full term] [Qualifier: singleton] [Condition: pregnant] [Person: women]